Clinical trial exclusion criterion:
the sound-side (contralateral) lower extremity must be free of impediments that affect gait, range of motion, or limb muscle activity

Annotated entities:
- Condition: "impediments that affect gait"
- Condition: "impediments that affect range of motion"
- Condition: "impediments that affect limb muscle activity"
- Observation: "lower extremity"
- Negation: "free"